heavily calcified vessels

The above is a clinical trial exclusion criterion. Annotated with entity spans:
[Condition: heavily calcified vessels]